Clinical trial inclusion criteria:
colorectal cancer above to 12 cm from the anal verge
unresectable synchronous metastases
no contraindications for chemotherapy
absence of peritoneal carcinomatosis, central nervous system o bone metastasis.
performance status ECOG = 2 (Eastern Cooperative Oncology Group)
uncontrolled concomitant medical conditions that may compromise to chemotherapy
significant symptomatic cardiac disease
not pregnancy or breastfeeding

Annotated entities:
- Condition: "colorectal cancer"
- Qualifier: "above to 12 cm from the anal verge"
- Qualifier: "unresectable"
- Qualifier: "synchronous"
- Condition: "metastases"
- Procedure: "chemotherapy"
- Condition: "contraindications"
- Negation: "no"
- Condition: "peritoneal carcinomatosis"
- Negation: "absence"
- Condition: "central nervous system metastasis"
- Condition: "bone metastasis"
- Measurement: "ECOG"
- Value: "= 2"
- Measurement: "performance status"
- Measurement: "Eastern Cooperative Oncology Group"
- Qualifier: "uncontrolled"
- Temporal: "concomitant"
- Condition: "medical conditions that may compromise to chemotherapy"
- Qualifier: "symptomatic"
- Condition: "cardiac disease"
- Qualifier: "significant"
- Condition: "pregnancy"
- Observation: "breastfeeding"
- Negation: "not"